List the cancers that are associated with SBLA syndrome.

Li-Fraumeni syndrome is an autosomal dominant inherited disorder also known as the SBLA cancer syndrome (sarcoma, breast, brain, lung, lymphoma, leukemia, laryngeal and adrenal).